Clinical trial inclusion criterion:
The patient was on nonsteroid anti-inflammatory drug (NSAID) treatment on the day when consent was obtained, and requires the long-term continuous treatment even after treatment with the investigational drug is started.

Annotated entities:
- Drug: "nonsteroid anti-inflammatory drug (NSAID)"
- Temporal: "on the day when consent was obtained"
- Reference_point: "the day when consent was obtained"
- Observation: "consent"